Clinical trial inclusion criterion:
Female or male, 20 - 80 years of age

Entity relations:
- Has_value("age", "20 - 80 years")